下列有關柯蒂氏器（organ of Corti）之敘述，何者錯誤？
A. 為聽覺之感覺器官，位於基底膜（basilar membrane）上
B. 含有單排之內毛細胞（inner hair cells）及多排之外毛細胞（outer hair cells）
C. 最長之靜纖毛與上方之覆膜（tectorial membrane）接觸或嵌入其中
D. 耳蝸頂端之毛細胞負責接受高頻率聲音之刺激

正確答案：D. 耳蝸頂端之毛細胞負責接受高頻率聲音之刺激